Clinical trial inclusion criterion:
4. Last (less than 3 months) HbA1c ≤ 10%.

Entity relations:
- Has_value("HbA1c", "≤ 10%")
- Has_temporal("HbA1c", "Last (less than 3 months)")